Currently prescribed pharmacotherapy for alcohol dependence (not including treatment of acute alcohol withdrawal syndrome)

The above is a clinical trial exclusion criterion. Annotated with entity spans:
[Temporal: Currently] prescribed [Procedure: pharmacotherapy] for [Condition: alcohol dependence] ([Negation: not including] [Procedure: treatment] of [Condition: acute alcohol withdrawal syndrome])